Presence of a preexisting significant GI condition that does not have a presumed causal relationship with MPA

The above is a clinical trial exclusion criterion. Annotated with entity spans:
Presence of a [Temporal: preexisting] [Qualifier: significant] [Condition: GI condition] that does not have a presumed causal relationship with MPA